Clinical trial exclusion criterion:
Use of immune suppressing medications

Annotated entities:
- Drug: "immune suppressing medications"